unstable medical condition like heart disease, uncontrolled hypertension, thyroid disease, diabetes, renal or liver impairment, or glaucoma

The above is a clinical trial exclusion criterion. Annotated with entity spans:
[Qualifier: unstable] [Condition: medical condition] like [Condition: heart disease], [Qualifier: uncontrolled] [Condition: hypertension], [Condition: thyroid disease], [Condition: diabetes], [Condition: renal] or [Condition: liver impairment], or [Condition: glaucoma]